What is the function of the SSX proteins?

The SYT protein appears to act as a transcriptional co-activator and the SSX proteins as co-repressors